Clinical trial exclusion criterion:
Women with childbearing potential or their male partners, who refuse to use an effective birth control method

Annotated entities:
- Pregnancy_considerations: "Women with childbearing potential or their male partners, who refuse to use an effective birth control method"